Adult subjects aged 18 years or older

The above is a clinical trial inclusion criterion. Annotated with entity spans:
[Person: Adult] subjects [Person: aged] [Value: 18 years or older]